1. Need for combined organ transplantation with an extra-renal organ and/or islet cell transplant.

The above is a clinical trial exclusion criterion. Annotated with entity spans:
1. Need for [Procedure: combined organ transplantation] with an [Qualifier: extra-renal organ] and/or [Procedure: islet cell transplant].